La calidad de un espectro puede definirse:
1. En función de la relación entre las intensidades de las bandas que contiene información (S) y el ruido (R).
2. En función de la longitud de onda seleccionada.
3. Sólo en función de la señal analítica.
4. En función de la relación entre la longitud de onda y el ruido.
5. En función del ruido de muy baja frecuencia.

Respuesta correcta: 1. En función de la relación entre las intensidades de las bandas que contiene información (S) y el ruido (R).